對一個 ASA class I 的 2 歲 12 公斤小男孩施行門診手術（Outpatient）的疝氣修補術，如果預計實施全身麻醉合併尾椎阻斷術（Caudal block），下列何者是最理想的尾椎阻斷術施打藥物組合及劑量？
A. 0.5% Bupivacaine 10 ml
B. 0.25% Bupivacaine 10 ml
C. 0.5% Bupivacaine 6 ml with morphine 2 mg
D. 0.2% Bupivacaine 6 ml with morphine 4 mg

正確答案：B. 0.25% Bupivacaine 10 ml